Clinical trial inclusion criterion:
Temperature less than 100.4 F

Entity relations:
- Has_value("Temperature", "less than 100.4 F")